Con respecto al enlace peptídico, indique cual de las siguientes afirmaciones es FALSA:
1. Tiene carácter parcial de doble enlace.
2. Forma un pequeño dipolo.
3. Su formación implica la eliminación de una molécula de agua.
4. La cadena peptídica gira libremente por el enlace peptídico.
5. En un enlace amida.

Respuesta correcta: 4. La cadena peptídica gira libremente por el enlace peptídico.